Previous low response (less than 3 oocytes on a high dose of FSH stimulation)

The above is a clinical trial exclusion criterion. Annotated with entity spans:
[Temporal: Previous] [Condition: low response] ([Value: less than 3] [Measurement: oocytes] on a [Procedure: high dose of FSH stimulation])